¿Cuál de las siguientes afirmaciones es cierta en relación con el efecto del agente desacoplantes de la fosforilación oxidativa 2,4dinitrofenol?:
1. Aumenta el gradiente de potencial de membrana.
2. Disminuye el gradiente de potencial de membrana, pero no el de pH.
3. Reintroduce H+ a la matriz mitocondrial.
4. Incrementa la cantidad de ATP producido.

Respuesta correcta: 3. Reintroduce H+ a la matriz mitocondrial.